Clinical trial inclusion criterion:
Age > 20 y/o.

Annotated entities:
- Person: "Age"
- Value: "> 20 y/o"